磺胺類藥物（sulfonamides）抑制細菌生長的藥理機轉為抑制下列那一項？
A. dihydrofolate reductase
B. cytochrome p450
C. dihydropteroate synthase
D. protease

正確答案：C. dihydropteroate synthase